Type 1 diabetes, Secondary diabetes, gestational diabetes

The above is a clinical trial exclusion criterion. Annotated with entity spans:
[Condition: Type 1 diabetes], [Condition: Secondary diabetes], [Condition: gestational diabetes]